Clinical trial exclusion criterion:
history of allergic disease likely to be stimulated by the vaccination

Entity relations:
- multi("stimulated by the vaccination", "vaccination")
- Has_qualifier("allergic disease", "stimulated by the vaccination")